Clinical trial inclusion criterion:
=18 years old, men or post-menopausal women (women with no periods for 12 months or more, or those who have had a surgical menopause)

Annotated entities:
- Value: "=18"
- Person: "years old"
- Person: "men"
- Condition: "post-menopausal"
- Person: "women"
- Condition: "no periods"
- Temporal: "for 12 months or more"
- Procedure: "surgical"
- Condition: "menopause"